Hombre de 42 años, casado, con tres hijos menores de edad. Sin antecedentes psiquiátricos. Tras un ERE en el banco en que trabajaba, es finalmente despedido y lleva 5 meses de paro. No encuentra otra actividad laboral. Acude a consulta con el siguiente cuadro clínico: desánimo general, inapetencia, nerviosismo, insomnio, preocupaciones recurrentes sobre su futuro y evitación de actividades sociofamiliares. ¿Qué opción diagnóstica de las siguientes es la más adecuada?
1. Trastorno obsesivo.
2. Trastorno adaptativo con síntomas ansiosodepresivos.
3. Fobia social.
4. Distimia.
5. Ansiedad con agorafobia.

Respuesta correcta: 2. Trastorno adaptativo con síntomas ansiosodepresivos.